Cognitive impairment

The above is a clinical trial exclusion criterion. Annotated with entity spans:
[Condition: Cognitive impairment]